Clinical trial exclusion criterion:
Chronic Kidney Disease (glomerular filtration rate <45 Milliliter per minute).

Annotated entities:
- Condition: "Chronic Kidney Disease"
- Measurement: "glomerular filtration rate"
- Value: "<45 Milliliter per minute"